下列有關吸煙之敘述，何者錯誤？
A. 吸煙者相較於未吸煙者，罹患胰臟癌與膀胱癌之風險較高
B. 吸煙會減緩theophylline、propranolol、oxazepam等藥之代謝速率，吸煙者使用此等藥物  	宜減量
C. 吸二手煙之小孩相較於未吸煙者，易發生中耳積水（effusion）與氣喘
D. 吸煙者相較於未吸煙者，使用口服避孕藥更容易發生缺血性中風與心肌梗塞之不良反應

正確答案：B. 吸煙會減緩theophylline、propranolol、oxazepam等藥之代謝速率，吸煙者使用此等藥物  	宜減量